La generación del vapor frío es una forma de introducción de la muestra para la atomización que se utiliza en espectrometría de absorción atómica (EAA) para analizar:
1. Plomo y Arsénico.
2. Mercurio.
3. Elementos que tienen una baja presión de vapor a temperatura ambiente.
4. Halógenos de elevado peso molecular.
5. Alcalinotérreos.

Respuesta correcta: 2. Mercurio.